Clinical trial exclusion criterion:
Amnestic and other cognitive disorder;

Annotated entities:
- Condition: "cognitive disorder"
- Condition: "Amnestic disorder"